Clinical trial exclusion criterion:
Received electroconvulsive therapy in the past 6 months or during the current depressive episode.

Annotated entities:
- Procedure: "electroconvulsive therapy"
- Temporal: "in the past 6 months"
- Temporal: "during the current depressive episode"
- Reference_point: "the current depressive episode"
- Temporal: "current"
- Condition: "depressive episode"